The participant has received levodopa monotherapy, any psychoneurotic agent or antiemetic medication of dopamine agonist within 14 days. However, the participant has been receiving quetiapine or domperidone with a stable dose regimen for >= 14 days may be included in the study.

The above is a clinical trial exclusion criterion. Annotated with entity spans:
The participant has received [Procedure: levodopa monotherapy], any [Drug: psychoneurotic agent] or [Drug: antiemetic medication of dopamine agonist] [Temporal: within 14 days]. However, the participant has been receiving [Drug: quetiapine] or [Drug: domperidone] with a [Qualifier: stable dose] regimen for [Temporal: >= 14 days] may be included in the study.